Clinical trial exclusion criterion:
Have had recent ST elevation myocardial infarction or non-ST elevation MI (< 30 days); note that biomarker elevation alone after ventricular arrhythmias does not denote MI.

Entity relations:
- Has_temporal("ST elevation myocardial infarction", "< 30 days")
- OR("ST elevation myocardial infarction", "non-ST elevation MI")